延髓（medulla oblongata）背面的面神經丘（facial colliculus），其直下方是那一對腦神經神經核的位置？
A. 三叉神經運動核（trigeminal motor nucleus）
B. 面神經運動核（facial motor nucleus）
C. 外旋神經核（abducens nucleus）
D. 滑車神經核（trochlear nucleus）

正確答案：C. 外旋神經核（abducens nucleus）